下列何者最不適合做腰椎穿刺（lumbar puncture）？
A. 腦部腫瘤病變
B. 腦膜炎
C. 蜘蛛網膜下腔出血
D. 交通性水腦症（communicating hydrocephalus）

正確答案：A. 腦部腫瘤病變